下列關於因腰椎穿刺（lumbar puncture）所引起的低顱內壓性頭痛（low pressure headache）的敘述，何者正確？
A. 會有視乳頭水腫
B. 不會有頸部僵直（neck stiffness）
C. 不會有噁心嘔吐的現象
D. 病人坐著會比躺著還要痛

正確答案：D. 病人坐著會比躺著還要痛